Clinical trial exclusion criterion:
significant unstable or uncontrolled medical/psychiatric disease

Annotated entities:
- Qualifier: "significant"
- Qualifier: "uncontrolled"
- Qualifier: "unstable"
- Condition: "psychiatric disease"
- Condition: "medical disease"